History of allergic reaction to abciximab or eptifibatide or any component used in the study (including contrast media)

The above is a clinical trial exclusion criterion. Annotated with entity spans:
[Temporal: History] of [Condition: allergic reaction] to [Drug: abciximab] or [Drug: eptifibatide] or any [Drug: component used in the study] (including [Drug: contrast media])